For which indication has inotersen been approved?

Inoteresen has been approved for patients in stage 1 and stage 2 hereditary transthyretin amyloidosis polyneuropathy.